角膜化學性灼傷之病患，下列何者與視力預後較無關聯？
A. 化學藥品的酸鹼特性
B. 眼角膜接觸化學藥品的時間
C. 輪部缺血或壞死之程度與範圍
D. 眼瞼紅腫的程度

正確答案：D. 眼瞼紅腫的程度